platelet count less than 100.000/mm3;

The above is a clinical trial exclusion criterion. Annotated with entity spans:
[Measurement: platelet count] [Value: less than 100.000/mm3];